Clinical trial inclusion criteria:
18 years of age or older;
Suffer from schizophrenia/schizoaffective disorder meeting Diagnostic and Statistical Manual of Mental Disorders, Fourth Edition, Text Revision (DSM-IV-TR) criteria;
Have a total baseline score on the Brief Psychiatric Rating Scale (BPRS) = 45;
Be capable and willing to provide written informed consent to participate in this study;
Agree to abide by the study protocol and its restrictions and be able to complete all aspects of the study, including all visits and tests

Annotated entities:
- Person: "age"
- Value: "18 years or older"
- Condition: "schizophrenia"
- Condition: "schizoaffective disorder"
- Measurement: "Diagnostic and Statistical Manual of Mental Disorders, Fourth Edition, Text Revision"
- Measurement: "DSM-IV-TR"
- Measurement: "Brief Psychiatric Rating Scale"
- Measurement: "BPRS"
- Value: "= 45"
- Informed_consent: "Be capable and willing to provide written informed consent to participate in this study"
- Post-eligibility: "Agree to abide by the study protocol and its restrictions and be able to complete all aspects of the study, including all visits and tests"